¿Cuál de las siguientes sustancias es un reactante de fase aguda negativo?
1. Albúmina.
2. Proteína C.
3. Fibrinógeno.
4. Haptoglobina.

Respuesta correcta: 1. Albúmina.